一位 88 歲男性有攝護腺肥大病史，主訴近半年來體能衰退很多，身體虛弱，3 個月前曾因近乎昏厥（near syncope）送至急診處，心跳較慢約 58/min，規則，抽血發現 Na+ 124 mmol/L，Troponin I＜0.012 ng/mL。病人無高血壓、糖尿病、抽菸、心絞痛及呼吸困難病史，安排核子醫學掃描，心臟超音波及 24 小時心電圖檢查均正常。一個月前全身無力更加重且有嚴重便秘，又至急診，身體檢查無呼吸困難，無脫水或四肢水腫。血中Na+ 104 mmol/L，其他生化檢查：Cr 1.0 mg/dL，BUN 15.3 mg/dL，K+ 5.4 mmol/L， 07 mmol/L，albumin 4.7 g/dL，blood sugar 113 mg/dL。下列敘述何者錯誤？
A. 此病人住院時 serum osmolality 為 248 mOsmol/kg H2O，urine osmolality 為 369 mOsmol/kg H2O，因此屬於 low osmolality 的 hyponatremia
B. 病人無 edema，為 euvolemic status，因此病因不會是心臟衰竭或肝腎病變
C. 病人 cortisol 23.3 μg/dL，ACTH 13.9 pg/mL，因此病因不是 cortisol deficiency
D. 病人 hsTSH 66.7 μIU/mL，因此病因為 hyperthyroidism

正確答案：D. 病人 hsTSH 66.7 μIU/mL，因此病因為 hyperthyroidism